Clinical trial inclusion criterion:
De novo lesion

Annotated entities:
- Condition: "De novo lesion"